Use of pharmacotherapy in the month prior to enrollment, including prior use of varenicline

The above is a clinical trial exclusion criterion. Annotated with entity spans:
Use of [Procedure: pharmacotherapy] in the [Temporal: month prior to enrollment], including prior use of varenicline